Azidothymidine（AZT）是一種核苷類似物（nucleoside analogue），主要在抑制人類免疫缺乏病毒 （HIV）複製過程中的那一個步驟？
A. 入侵（Entry）
B. 轉譯（Translation）
C. 反轉錄（Reverse transcription）
D. 成熟（Maturation）

正確答案：C. 反轉錄（Reverse transcription）